En un hipertiroideo se puede observar:
1. Movimientos lentos y perezosos.
2. Aumento de la frecuencia cardiaca.
3. Intolerancia al frío.
4. Sobrepeso.

Respuesta correcta: 2. Aumento de la frecuencia cardiaca.